Clinical trial exclusion criterion:
Drug and / or alcohol abusers

Entity relations:
- OR("Drug abusers", "alcohol abusers")